Clinical trial exclusion criteria:
1. Prior treatment with gemcitabine, carboplatin (except in the adjuvant setting), or Iniparib.
2. Past or current history of neoplasm other than the entry diagnosis, with the exception of treated non-melanoma skin cancer or carcinoma in-situ of any primary site, or invasive cancers treated definitively, with treatment ending >5 years previously and no evidence of recurrences.
3. A history of cardiac disease, as defined by:
Malignant hypertension
Unstable angina
Congestive heart failure
Myocardial infarction within the previous 6 months
Symptomatic, unstable or uncontrolled, cardiac arrhythmias. Patients who have stable, rate-controlled atrial fibrillation are eligible for study enrollment.
4. Active brain metastases. Patients with treated brain metastases are eligible, if (1) radiation therapy was completed at least 2 weeks prior to study entry; (2) follow-up scan shows no disease progression; and (3) patient does not require steroids.
5. Women who are pregnant or lactating.
6. Any serious, active infection (> Grade 2) at the time of treatment.
7. A serious underlying medical condition that would impair the ability of the patient to receive protocol treatment.
8. A major surgical procedure, or significant traumatic injury ≤28 days of beginning treatment, or anticipation of the need for major surgery during the course of the study.
9. Uncontrolled or intercurrent illness including, that in the opinion of the investigator may increase the risks associated with study participation or administration of the investigational products, or that may interfere with the interpretation of the results.
10. History of any medical or psychiatric condition or laboratory abnormality that, in the opinion of the investigator, may increase the risks associated with the study participation or administration of the investigational products, or that may interfere with the interpretation of the results.
11. Known or suspected allergy/hypersensitivity to any agent given in the course of this trial.
The above information is not intended to contain all considerations relevant to a patient's potential participation in a clinical trial.

Annotated entities:
- Drug: "gemcitabine"
- Drug: "carboplatin"
- Drug: "Iniparib"
- Temporal: "Prior"
- Condition: "neoplasm"
- Condition: "non-melanoma skin cancer"
- Procedure: "treated"
- Qualifier: "treated"
- Condition: "carcinoma in-situ"
- Condition: "cancers"
- Qualifier: "invasive"
- Qualifier: "treated definitively"
- Procedure: "treated"
- Negation: "with the exception of"
- Temporal: ">5 years previously"
- Observation: "evidence of recurrences"
- Negation: "no"
- Temporal: "history"
- Temporal: "current"
- Temporal: "Past"
- Qualifier: "other than the entry diagnosis"
- Condition: "entry diagnosis"
- Condition: "cardiac disease"
- Temporal: "history"
- Parsing_Error: "as defined by"
- Condition: "Malignant hypertension"
- Condition: "Unstable angina"
- Condition: "Congestive heart failure"
- Condition: "Myocardial infarction"
- Temporal: "within the previous 6 months"
- Condition: "cardiac arrhythmias"
- Qualifier: "uncontrolled"
- Qualifier: "unstable"
- Qualifier: "Symptomatic"
- Condition: "atrial fibrillation"
- Grammar_Error: "are eligible"
- Negation: "are eligible"
- Qualifier: "rate-controlled"
- Qualifier: "stable"
- Condition: "brain metastases"
- Temporal: "Active"
- Condition: "brain metastases"
- Procedure: "treated"
- Qualifier: "treated"
- Negation: "are eligible"
- Grammar_Error: "are eligible"
- Procedure: "radiation therapy"
- Temporal: "at least 2 weeks prior to study entry"
- Reference_point: "study entry"
- Condition: "disease progression"
- Procedure: "follow-up scan"
- Negation: "no"
- Drug: "steroids"
- Negation: "not"
- Mood: "require"
- Condition: "pregnant"
- Person: "Women"
- Condition: "lactating"
- Pregnancy_considerations: "Women who are pregnant or lactating"
- Condition: "infection"
- Value: "> Grade 2"
- Qualifier: "> Grade 2"
- Qualifier: "serious"
- Temporal: "active"
- Subjective_judgement: "serious"
- Condition: "medical condition"
- Qualifier: "serious"
- Subjective_judgement: "serious"
- Post-eligibility: "A serious underlying medical condition that would impair the ability of the patient to receive protocol treatment."
- Condition: "impair the ability of the patient to receive protocol treatment"
- Mood: "would"
- Procedure: "surgical procedure"
- Qualifier: "major"
- Subjective_judgement: "major"
- Qualifier: "significant"
- Subjective_judgement: "significant"
- Condition: "traumatic injury"
- Temporal: "≤28 days of beginning treatment"
- Reference_point: "beginning treatment"
- Procedure: "major surgery"
- Mood: "need for"
- Temporal: "during the course of the study"
- Reference_point: "the course of the study"
- Qualifier: "Uncontrolled"
- Temporal: "intercurrent"
- Condition: "illness"
- Qualifier: "in the opinion of the investigator may increase the risks"
- Subjective_judgement: "in the opinion of the investigator may increase the risks"
- Post-eligibility: "9. Uncontrolled or intercurrent illness including, that in the opinion of the investigator may increase the risks associated with study participation or administration of the investigational products, or that may interfere with the interpretation of the results."
- Condition: "psychiatric condition"
- Condition: "laboratory abnormality"
- Procedure: "laboratory"
- Post-eligibility: "History of any medical or psychiatric condition or laboratory abnormality that, in the opinion of the investigator, may increase the risks associated with the study participation or administration of the investigational products, or that may interfere with the interpretation of the results."
- Condition: "hypersensitivity"
- Condition: "allergy"
- Mood: "Known"
- Mood: "suspected"
- Drug: "agent given in the course of this trial"
- Post-eligibility: "Known or suspected allergy/hypersensitivity to any agent given in the course of this trial"
- Not_a_criteria: "The above information is not intended to contain all considerations relevant to a patient's potential participation in a clinical trial."